Clinical trial inclusion criteria:
Diagnosis of uncomplicated gastroschisis
Gestational age >33 weeks at time of delivery
Weight >1900g at time of delivery
Transfer of patient to Riley Hospital for Children prior to any abdominal surgery

Annotated entities:
- Qualifier: "uncomplicated"
- Condition: "gastroschisis"
- Measurement: "Gestational age"
- Value: ">33 weeks"
- Temporal: "at time of delivery"
- Measurement: "Weight"
- Value: ">1900g"
- Temporal: "at time of delivery"
- Visit: "Riley Hospital for Children"
- Temporal: "prior to any abdominal surgery"
- Procedure: "abdominal surgery"
- Reference_point: "any abdominal surgery"
- Procedure: "Transfer"